Clinical trial exclusion criterion:
Severe extrahepatic diseases: cardiovascular, respiratory, cerebrovascular and poorly controlled diabetes.

Annotated entities:
- Condition: "extrahepatic diseases"
- Undefined_semantics: "extrahepatic diseases"
- Qualifier: "Severe"
- Undefined_semantics: "Severe"
- Subjective_judgement: "Severe"
- Condition: "cardiovascular"
- Condition: "respiratory"
- Condition: "cerebrovascular"
- Condition: "diabetes"
- Qualifier: "poorly controlled"
- Grammar_Error: "and"